4. Agreement not to attempt to become pregnant

The above is a clinical trial inclusion criterion. Annotated with entity spans:
[Parsing_Error: 4.] [Non-query-able: Agreement not to attempt to become pregnant]